Clinical trial inclusion criterion:
5. If female and of childbearing potential, has a negative pregnancy test.

Entity relations:
- Has_value("pregnancy test", "negative")
- AND("childbearing potential", "pregnancy test")
- AND("female", "pregnancy test")